Clinical trial inclusion criterion:
Treated in our IVF unit for frozen-thawed embryo transfer

Annotated entities:
- Visit: "our IVF unit"
- Procedure: "frozen-thawed embryo transfer"